34歲男性，於健康檢查時發現高血鈣，低血磷，進一步測定 intact parathyroid hormone（iPTH）發現過高，為750 pg/mL，但超音波檢查並沒有發現副甲狀腺腺瘤，這時進一步做何檢查最恰當？
A. 副甲狀腺Tc99m-sestamibi scan＋SPECT（single photon emission computed tomography）
B. I-131 thyroid uptake and scan
C. 頸部MRI（magnetic resonance imaging）
D. 頸部CT（computed tomography）

正確答案：A. 副甲狀腺Tc99m-sestamibi scan＋SPECT（single photon emission computed tomography）